Clinical trial exclusion criterion:
cognitive impairment (< 120 points on the Mattis Dementia Rating Scale)

Entity relations:
- Has_value("Mattis Dementia Rating Scale", "< 120 points")